Clinical trial inclusion criterion:
Body Mass Index (BMI) = 35 kg/m2

Entity relations:
- Has_value("Body Mass Index (BMI)", "= 35 kg/m2")